一足月兒出生時正常，第三天呈現多次嘔吐而就醫；理學檢查發現：病人有中度脫水、嘔吐出膽汁 。則下列處置何項不適當？
A. 馬上禁食
B. 放置鼻胃管
C. 給予 10%葡萄糖靜脈輸液
D. J 安排腹部 X 光檢查

正確答案：C. 給予 10%葡萄糖靜脈輸液